Clinical trial exclusion criterion:
severe respiratory disease

Annotated entities:
- Qualifier: "severe"
- Condition: "respiratory disease"